El primer signo morfológico de la gastrulación humana es la:
1. Formación del tubo neural.
2. Formación de la línea primitiva.
3. Implantación.
4. Compactación.
5. Ovulación.

Respuesta correcta: 2. Formación de la línea primitiva.